CAD:Presence of any one of the following: Angina plus positive exercise tolerance test, enzyme and/or Q wave positive myocardial infarction, angiographic evidence ( >50% stenosis of one vessel), percutaneous or surgical coronary revascularisation.

The above is a clinical trial inclusion criterion. Annotated with entity spans:
[Condition: CAD]:Presence of any one of the following: [Condition: Angina] plus [Value: positive] [Measurement: exercise tolerance test], [Qualifier: enzyme] and/or [Qualifier: Q wave positive] [Condition: myocardial infarction], [Condition: angiographic evidence] ( [Value: >50%] [Measurement: stenosis of one vessel]), [Qualifier: percutaneous] or [Qualifier: surgical] [Procedure: coronary revascularisation].